Clinical trial exclusion criterion:
Pregnant or possibly pregnant woman, or breastfeeding woman, or woman who wishes to become pregnant during study participation;

Annotated entities:
- Pregnancy_considerations: "Pregnant or possibly pregnant woman, or breastfeeding woman, or woman who wishes to become pregnant during study participation"